¿Con qué teoría explicativa de las fobias infantiles se relaciona más estrechamente el efecto Napalkov?
1. La teoría de los dos factores de Mowrer.
2. La teoría de la incubación de Eysenck.
3. La teoría del aprendizaje social de Bandura.
4. La teoría bioinformacional de la emoción de Lang.
5. La teoría de la sensibilidad a la ansiedad de Reiss.

Respuesta correcta: 2. La teoría de la incubación de Eysenck.